Clinical trial exclusion criterion:
Active prostatitis or urinary tract infection

Entity relations:
- Has_temporal("prostatitis", "Active")
- Has_temporal("urinary tract infection", "Active")
- OR("prostatitis", "urinary tract infection")